有關皮膚與黏膜的防禦作用，下列敘述何者錯誤？
A. 皮膚的外層細胞角質化，可增強對病原體的防禦能力
B. 胃黏膜的強酸性胃液，可摧毀大部分細菌
C. 皮脂腺分泌的油脂可阻止細菌繁殖
D. 皮膚表面的鹼性狀態，可阻止微生物在皮膚繁殖

正確答案：D. 皮膚表面的鹼性狀態，可阻止微生物在皮膚繁殖